Which are the subunits of the transcription factor NF-kappaB in the canonical pathway activation?

The NF-κB canonical pathway is mediated by the p65/relA and p50 subunits.